Clinical trial exclusion criterion:
history of fetal cytomegalovirus infection

Entity relations:
- Has_qualifier("cytomegalovirus infection", "fetal")